下列有關阿米巴的敘述，何者錯誤？
A. 寄生人體的阿米巴類，大多數的種類無致病性
B. 寄生人體的阿米巴類都會形成囊體
C. 腸道寄生的阿米巴可以用 hematoxylin 及 trichrome stain 來染色
D. 細胞核的形態是阿米巴的分類依據之一

正確答案：B. 寄生人體的阿米巴類都會形成囊體